Clinical trial exclusion criterion:
Developmental delay, intellectual deficit, and/or severe educational disability resulting in some dependence for activities of daily living

Annotated entities:
- Condition: "Developmental delay"
- Condition: "intellectual deficit"
- Condition: "evere educational disability"
- Condition: "dependence for activities of daily living"